下列關於精神分裂症心理社會治療（psychosocial treatment）的敘述，何者錯誤？
A. 心理分析治療是精神分裂症的主要治療方式
B. 團體心理治療重點在於情緒的支持、疾病的適應、人際互動的增進、社交技巧的訓練
C. 家庭治療重點在對家屬疾病的衛教、情緒支持、減少家人高情緒表露（high expressed emotion）的情形
D. 復健治療重點在自我照顧訓練、獨立生活訓練、社交技巧訓練、職業技能訓練

正確答案：A. 心理分析治療是精神分裂症的主要治療方式